History of allergic rhinitis

The above is a clinical trial inclusion criterion. Annotated with entity spans:
History of [Condition: allergic rhinitis]